Which syndrome is associated with mutant DVL1?

Mutations in DVL1 cause an osteosclerotic form of Robinow syndrome.